Clinical trial inclusion criterion:
7. Adequate liver function as follows (10% deviation allowed)

Entity relations:
- Has_value("liver function", "Adequate")